Clinical trial exclusion criterion:
Subject with clinical evidence of renal disease with the past 6 months, defined as estimated glomerular filtration rate (GFR) outside the normal reference range.

Entity relations:
- Has_temporal("renal disease", "with the past 6 months")
- Has_index("outside", "normal reference range")
- Has_value("estimated glomerular filtration rate (GFR)", "outside")